Clinical trial exclusion criterion:
Uncontrolled heart failure or NYHA function class III or IV

Annotated entities:
- Qualifier: "Uncontrolled"
- Condition: "heart failure"
- Measurement: "NYHA function class"
- Value: "III"
- Value: "IV"